Clinical trial exclusion criteria:
Suicidal patients and/or severe automutilation behavior and/or psychotic symptoms and/or lack of event memory.

Annotated entities:
- Condition: "Suicidal"
- Condition: "automutilation behavior"
- Qualifier: "severe"
- Condition: "psychotic symptoms"
- Condition: "lack of event memory"